Clinical trial inclusion criteria:
Subjects aged 18 to 80 years old
Overweight or obesity (BMI =25 kg/m2)
Previous diagnosis of type 2 diabetes, fulfilling at least one of the following criteria: 1) current treatment with oral antidiabetic drugs and/or insulin; 2) a fasting glucose value above 126 mg/dl on at least 2 occasions; 3) blood glucose level at 2 hours after an oral glucose tolerance test is equal to or more than 200 mg/dl; or 4) a glycated hemoglobin (HbA1c) level > 6.5 %
Clinical diagnosis of diabetic nephropathy, with a urinary albumin/creatinine ratio >30 mg/g and an estimated glomerular filtration rate more than 20 ml/min per 1.73 m2.
Treatment with stable doses of angiotensin-converting enzyme inhibitors, angiotensin II receptor blockers or anti-aldosterone agents in the last four weeks.

Annotated entities:
- Value: "18 to 80 years old"
- Person: "aged"
- Condition: "obesity"
- Measurement: "BMI"
- Value: "=25 kg/m2"
- Condition: "Overweight"
- Condition: "type 2 diabetes"
- Multiplier: "at least one"
- Temporal: "Previous"
- Temporal: "current"
- Drug: "oral antidiabetic drugs"
- Drug: "insulin"
- Measurement: "fasting glucose"
- Value: "above 126 mg/dl"
- Multiplier: "on at least 2 occasions"
- Measurement: "blood glucose level"
- Value: "equal to or more than 200 mg/dl"
- Temporal: "at 2 hours after an oral glucose tolerance test"
- Reference_point: "an oral glucose tolerance test"
- Procedure: "oral glucose tolerance test"
- Measurement: "glycated hemoglobin (HbA1c) level"
- Value: "> 6.5 %"
- Condition: "diabetic nephropathy"
- Measurement: "urinary albumin/creatinine ratio"
- Value: ">30 mg/g"
- Measurement: "estimated glomerular filtration rate"
- Value: "more than 20 ml/min per 1.73 m2"
- Drug: "angiotensin-converting enzyme inhibitors"
- Multiplier: "stable doses"
- Drug: "angiotensin II receptor blockers"
- Drug: "anti-aldosterone agents"
- Temporal: "in the last four weeks"